Clinical trial exclusion criterion:
Women with confirmed or suspected pregnancy

Entity relations:
- Has_qualifier("pregnancy", "confirmed")
- OR("confirmed", "suspected")